下列有關腹腔臟器之敘述，何者錯誤？
A. 右胃靜脈（right gastric vein）匯入肝門靜脈（portal vein）
B. 腸繫膜下靜脈（inferior mesenteric vein）匯入脾靜脈
C. 支配胃前面的前迷走神經幹源自右迷走神經
D. 短胃動脈（short gastric arteries）供血到胃底部（fundus）

正確答案：C. 支配胃前面的前迷走神經幹源自右迷走神經